health status compatible with detention in police cells

The above is a clinical trial inclusion criterion. Annotated with entity spans:
[Measurement: health status] [Value: compatible with detention in police cells]